BDI = 30 points

The above is a clinical trial exclusion criterion. Annotated with entity spans:
[Measurement: BDI] [Value: = 30 points]